Clinical trial inclusion criterion:
imaging findings of degenerative changes of the joint (osteoarthritis or chondropathy with Kellgren Lawrence Score from 0 to 3 at X-ray evaluation).

Entity relations:
- Has_value("Kellgren Lawrence Score", "from 0 to 3")
- AND("X-ray", "Kellgren Lawrence Score")
- Subsumes("degenerative changes", "X-ray")
- AND("imaging", "degenerative changes")
- OR("osteoarthritis", "chondropathy")